Clinical trial exclusion criterion:
Ongoing or active systemic infection, active hepatitis B or C virus infection, or known human immunodeficiency virus positive.

Entity relations:
- Has_qualifier("hepatitis B virus infection", "active")
- Has_temporal("systemic infection", "Ongoing")
- Has_value("human immunodeficiency virus", "positive")
- OR("hepatitis B virus infection", "C virus infection")
- OR("Ongoing", "active")
- OR("systemic infection", "hepatitis B virus infection", "human immunodeficiency virus")